Clinical trial inclusion criterion:
4. self-reported failure of eccentric exercise protocol (at least 75% completion)

Entity relations:
- Has_value("failure of eccentric exercise protocol", "at least 75%")
- Has_context("failure of eccentric exercise protocol", "self-reported")